Where is the protein CLIC1 localized?

CLIC1 is an intracellular chloride ion channel that is localized both to the nucleus and to the cytolasm.